Enrollment in a clinical study evaluating another device or drug, within the past 6 months

The above is a clinical trial exclusion criterion. Annotated with entity spans:
[Competing_trial: Enrollment in a clinical study evaluating another device or drug, within the past 6 months]